Clinical trial exclusion criterion:
Body mass index less than 18 kg/m2 or greater than 30 kg/m2.

Annotated entities:
- Measurement: "Body mass index"
- Value: "less than 18 kg/m2"
- Value: "greater than 30 kg/m2"